Clinical trial inclusion criterion:
Ketonuria as confirmed on urine point-of-care testing or urinalysis

Entity relations:
- AND("Ketonuria", "urine point-of-care testing")
- OR("urine point-of-care testing", "urinalysis")